一位 40 歲病人主訴咳血，X 光顯示局部肺實質化（consolidation）併有新月形腎絲球腎炎（crescentic glomerulonephritis）。其診斷最有可能為：
A. Goodpasture syndrome
B. idiopathic pulmonary hemosiderosis
C. 肺高壓
D. 肺炎併發敗血症

正確答案：A. Goodpasture syndrome